Clinical trial exclusion criterion:
American Association of Anesthesiology class 1-3

Annotated entities:
- Measurement: "American Association of Anesthesiology class"
- Value: "1-3"